Cuando se hace reaccionar ciclopentanona con pirrolidina se forma:
1. Amina.
2. Amida.
3. Enamina.
4. Acetal.
5. Oxima.

Respuesta correcta: 3. Enamina.